Una de las siguientes afirmaciones referidas a los virus de la hepatitis NO es correcta. Indíquela:
1. En contraste con el VHB y VHC, la transmisión por sangre del VHA es poco común, porque la viremia es breve y de bajo título.
2. El VHE es un virus defectivo que usa el antígeno del superficie del VHB como su proteína de envoltura.
3. La polimerasa codificada por el VHB actúa como una transcriptasa inversa usando el RNAm vírico como molde para la síntesis de los genomas de DNA progenie.
4. La detección del HBsAg durante más de seis meses indica un estado del portador crónico.

Respuesta correcta: 2. El VHE es un virus defectivo que usa el antígeno del superficie del VHB como su proteína de envoltura.